Clinical trial inclusion criterion:
3. If female of childbearing potential must be willing to practice sexual abstinence or dual methods of contraception during treatment and for at least 30 days after the last dose of study drug.

Annotated entities:
- Person: "female"
- Condition: "childbearing potential"
- Observation: "willing"
- Procedure: "practice sexual abstinence"
- Multiplier: "dual"
- Procedure: "methods of contraception"
- Temporal: "during treatment"
- Temporal: "for at least 30 days after the last dose of study drug"
- Reference_point: "the last dose of study drug"